Significant valve disease (severe aortic stenosis or regurgitation; severe mitral regurgitation)

The above is a clinical trial exclusion criterion. Annotated with entity spans:
Significant [Condition: valve disease] ([Qualifier: severe] [Condition: aortic stenosis] or [Condition: regurgitation]; [Qualifier: severe] [Condition: mitral regurgitation])